Clinical trial exclusion criterion:
Has a known history of corneal hypoesthesia (reduced corneal sensitivity)

Annotated entities:
- Condition: "corneal hypoesthesia"
- Condition: "reduced corneal sensitivity"
- Temporal: "history"